Clinical trial exclusion criterion:
Use of topical or systemic drug products classified as forbidden

Annotated entities:
- Non-representable: "Use of topical or systemic drug products classified as forbidden"